What is the effect of notch in the division of neural progenitor cells in Drosophila?

Canonical Notch signaling has diverse functions during nervous system development and is critical for neural progenitor self-renewal, timing of differentiation and specification of various cell fates. In the adult mammalian brain niches for neural stem cells are maintained, which enable a steady-state neurogenesis. This process is tightly regulated by multiple niche factors, including Notch and NF-κB signaling. As a result of Notch activation, neuronal differentiation is inhibited in neighboring cells and they remain neural progenitor cells.